¿Qué procedimiento forma parte del programa de intervención cognitivo-conductual para la hipocondría propuesto por Warwick y Salkovskis?:
1. La desensibilización sistemática en imaginación para extinguir el temor a las sensaciones interoceptivas.
2. La detención del pensamiento para bloquear los pensamientos intrusivos sobre la enfermedad.
3. El entrenamiento en mindfulness para reducir la aparición de sensaciones corporales molestas.
4. La prevención de respuesta para reducir las conductas de comprobación corporal y de búsqueda de información tranquilizadora.
5. La resolución de los conflictos subyacentes relacionados con la culpa y las necesidades de dependencia.

Respuesta correcta: 4. La prevención de respuesta para reducir las conductas de comprobación corporal y de búsqueda de información tranquilizadora.